El coeficiente de correlación de Pearson:
1. Siempre es mayor que 1.
2. Siempre es menor que 1.
3. Esta comprendido entre 0 y 1.
4. Esta comprendido entre -1 y 0.
5. Esta comprendido entre -1 y 1.

Respuesta correcta: 5. Esta comprendido entre -1 y 1.